Clinical trial inclusion criterion:
Spinal Cord injury at or above L5

Annotated entities:
- Condition: "Spinal Cord injury"
- Qualifier: "at or above L5"